下列有關 glucocorticoid 影響脂肪代謝之敘述，何者錯誤？
A. 促進β型交感神經作用劑之脂肪分解作用
B. 促使身體脂肪再分布
C. 增加脂肪分布至臉部
D. 增加脂肪分布至四肢

正確答案：D. 增加脂肪分布至四肢